Clinical trial inclusion criterion:
Patient with a high or very high cardiovascular risk treated by lipidlowering therapy with statin

Entity relations:
- AND("lipidlowering therapy", "stati")
- Has_qualifier("cardiovascular risk", "high")
- AND("cardiovascular risk", "lipidlowering therapy")
- OR("high", "very high")